Clinical trial inclusion criterion:
scheduled to receive ISB and general anesthesia as a day surgery patient for rotator cuff repair and acromioplasty, as a part of planned routine care

Annotated entities:
- Procedure: "rotator cuff repair"
- Procedure: "acromioplasty"
- Qualifier: "day surgery"
- Procedure: "ISB"
- Procedure: "general anesthesia"